Señale cuál de las siguientes alteraciones NO se corresponde con las manifestaciones clínicas de la diabetes tipo 1 en los niños:
1. Aumento de peso.
2. Polidipsia.
3. Estreñimiento.
4. Polifagia.
5. Sudoración.

Respuesta correcta: 1. Aumento de peso.